paraben allergy

The above is a clinical trial exclusion criterion. Annotated with entity spans:
[Drug: paraben] [Condition: allergy]